學齡兒童診斷注意力不足過動症後，在使用methylphenidate治療時，最需注意那個副作用？
A. 食慾不振
B. 無顆粒球血症（agranulocytosis）
C. 錐體外徑症候群（extrapyramidal tract syndrome）
D. 抽搐（seizures）

正確答案：A. 食慾不振